diabetes mellitus.

The above is a clinical trial exclusion criterion. Annotated with entity spans:
[Condition: diabetes mellitus].